Clinical trial exclusion criterion:
have a residual limb length which does not allow for seven inches clearance of bracket attachment for the PowerFoot

Entity relations:
- Has_value("residual limb length", "does not allow for seven inches clearance of bracket attachment")